嚴重鉛中毒引起的腦部病變，應立即給予下列何種藥物治療最佳？
A. Deferoxamine
B. Edetate calcium disodium（EDTA）
C. Penicillamine
D. Succimer

正確答案：B. Edetate calcium disodium（EDTA）